Clinical trial exclusion criterion:
Stroke or coronary revascularization in the past 6 months.

Annotated entities:
- Procedure: "coronary revascularization"
- Procedure: "Stroke revascularization"
- Temporal: "in the past 6 months"